The subject has given written informed, dated consent to participate in the study

The above is a clinical trial inclusion criterion. Annotated with entity spans:
The subject has [Observation: given written informed], dated consent to participate in the study